1. Patients with lumbar common diseases(e.g., Lumbar disc, Lumbar spinal stenosis, Lumbar slippage, etc)

The above is a clinical trial exclusion criterion. Annotated with entity spans:
1. Patients with [Condition: lumbar] common diseases(e.g., [Condition: Lumbar disc], [Condition: Lumbar spinal stenosis], [Condition: Lumbar slippage], etc)